Other protocol defined exclusion criteria could apply

The above is a clinical trial exclusion criterion. Annotated with entity spans:
[Non-representable: Other protocol defined exclusion criteria could apply]